Clinical trial inclusion criterion:
Motor complete tetraplegia for at least 3 months

Annotated entities:
- Condition: "tetraplegia"
- Qualifier: "complete"
- Temporal: "at least 3 months"